Explain the action of Balovaptan.

Balovaptan is an investigational vasopressin 1a receptor antagonist that has been evaluated for improvement of social communication and interaction.